一位55歲病人因腫瘤而安排須注射顯影劑（contrast medium）的電腦斷層攝影（CT scan），下列敘述何者錯誤？
A. 顯影劑腎病變產生的原因包括腎小管阻塞或腎血行動力學改變
B. 顯影劑腎病變很少出現尿液fractional excretion of sodium（FeNa）＜1%
C. 糖尿病是產生顯影劑腎病變的危險因子之一
D. 高危險病人一定要做含顯影劑之檢查時，可先適度補充液體（hydration）

正確答案：B. 顯影劑腎病變很少出現尿液fractional excretion of sodium（FeNa）＜1%